Clinical trial exclusion criterion:
LVEF <40% or clinically overt congestive heart failure

Annotated entities:
- Measurement: "LVEF"
- Value: "<40%"
- Qualifier: "clinically overt"
- Condition: "congestive heart failure"